Mujer de 64 años que acude a su consulta refiriendo sangrado genital de varios meses de evolución. Niega tratamiento hormonal sustitutivo y anticoagulación. Aporta citología cervicovaginal normal. Exploración física general y genital sin hallazgos de interés. IMC de 38 Kg/m2. Indique la actitud más correcta:
1. Prescribir progesterona cíclica.
2. Biopsia endometrial.
3. Biopsias de cérvix al azar.
4. Valoración hormonal con FSH, LH y estradiol.

Respuesta correcta: 2. Biopsia endometrial.